Clinical trial exclusion criterion:
contraindications to dexmedetomidine

Entity relations:
- AND("contraindications", "dexmedetomidine")